下列病毒中，現在何種能以施打減毒疫苗方式進行最佳預防？
A. 單純疱疹病毒（Herpes simplex virus）
B. 第八型人類疱疹病毒（Human herpesvirus-8）
C. EB病毒（Epstein-Barr virus）
D. 水痘-帶狀疱疹病毒（Varicella-zoster virus）

正確答案：D. 水痘-帶狀疱疹病毒（Varicella-zoster virus）